Clinical trial exclusion criterion:
Patients surgically treated for the same defect within one year;

Annotated entities:
- Procedure: "surgically treated"
- Condition: "the same defect"
- Temporal: "within one year"